Clinical trial inclusion criterion:
Cervical cerclage 1st or 2nd trimester of pregnancy undergoing with spinal anesthesia

Annotated entities:
- Procedure: "Cervical cerclage"
- Qualifier: "1st trimester"
- Qualifier: "2nd trimester"
- Condition: "pregnancy"
- Procedure: "spinal anesthesia"